Fitzpatrick Skin phototype IV-VI, non-white race/ethnicity, including but not limited to - --African Americans, Asians, Pacific Islanders and Hispanics.

The above is a clinical trial inclusion criterion. Annotated with entity spans:
[Measurement: Fitzpatrick Skin phototype] [Value: IV-VI], [Person: non-white race/ethnicity], including but not limited to - --[Person: African Americans], [Person: Asians], [Person: Pacific Islanders] and [Person: Hispanics].